Clinical trial exclusion criterion:
Patients at potential increased risk of iatrogenic probiotic infection (see Section 2.6 for detailed explanation) including specific immunocompromised populations (HIV <200 CD4 cells/µL, those receiving chronic immunosuppressive medications (e.g., azathioprine, cyclosporine, cyclophosphamide, tacrolimus, methotrexate, mycofenolate, Anti-IL2), previous transplantation (including stem cell) at any time, malignancy requiring chemotherapy in the last 3 months, neutropenia [absolute neutrophil count < 500]). However, patients receiving corticosteroids previously or presently or projected to receive corticosteroids are not excluded;

Annotated entities:
- Observation: "risk of iatrogenic probiotic infection"
- Condition: "immunocompromised"
- Condition: "HIV"
- Measurement: "CD4"
- Value: "<200 cells/µL"
- Procedure: "immunosuppressive medications"
- Qualifier: "chronic"
- Drug: "azathioprine"
- Drug: "cyclosporine"
- Drug: "cyclophosphamide"
- Drug: "tacrolimus"
- Drug: "methotrexate"
- Drug: "mycofenolate"
- Drug: "Anti-IL2"
- Procedure: "transplantation"
- Procedure: "chemotherapy"
- Temporal: "last 3 months"
- Condition: "neutropenia"
- Measurement: "absolute neutrophil count"
- Value: "< 500]"